Clinical trial inclusion criterion:
Women who are pre-menopausal must have a negative serum pregnancy test

Entity relations:
- Has_value("serum pregnancy test", "negative")
- AND("Women", "serum pregnancy test")
- AND("pre-menopausal", "serum pregnancy test")